Females of child bearing potential not using acceptable method of birth control prior to or during study

The above is a clinical trial exclusion criterion. Annotated with entity spans:
[Person: Females] of [Condition: child bearing potential] [Negation: not] using [Qualifier: acceptable] [Observation: method of birth control] [Temporal: prior to] or [Temporal: during study]